Clinical trial inclusion criteria:
Women at any age with early stage breast cancer (stage I-II) and American Society of Anesthesiologists (ASA) score of I-II.

Annotated entities:
- Person: "Women"
- Person: "any age"
- Value: "early"
- Measurement: "stage"
- Condition: "breast cancer"
- Measurement: "stage"
- Value: "I-II"
- Measurement: "American Society of Anesthesiologists (ASA) score"
- Value: "I-II"